DeQuervain's disease 中是那二條肌腱被扼緊（entrapment）？
A. Abductor pollicis longus 和 extensor pollicis longus
B. Abductor pollicis brevis 和 extensor pollicis longus
C. Abductor pollicis longus 和 extensor pollicis brevis
D. Abductor pollicis brevis 和 extensor pollicis brevis

正確答案：C. Abductor pollicis longus 和 extensor pollicis brevis